Clinical trial exclusion criterion:
hepatic insufficiency (three times the upper limit of normal (ULN) for aspartate aminotransferase (AST) and/or alanine aminotransferase (ALT)); liver transplant recipient; cirrhosis of the liver;

Annotated entities:
- Condition: "hepatic insufficiency"
- Measurement: "aspartate aminotransferase"
- Measurement: "AST"
- Measurement: "alanine aminotransferase"
- Measurement: "ALT"
- Value: "three times the upper limit of normal"
- Procedure: "liver transplant"
- Condition: "cirrhosis of the liver"